Hospital admission for protein losing enteropathy or plastic bronchitis within 3 months of randomization

The above is a clinical trial exclusion criterion. Annotated with entity spans:
[Procedure: Hospital admission] for [Condition: protein losing enteropathy] or [Condition: plastic bronchitis] [Temporal: within 3 months of randomization]